下列何種酵素活性增加可造成癌細胞無法進行正常細胞的老化現象？
A. 去	氧	核	糖	核	酸聚 合	酶－甲型（DNA polymerase alpha）
B. 去	氧	核	糖	核	酸聚 合	酶－丁型（DNA polymerase delta）
C. 去	氧	核	糖	核	酸接	合	酶（DNA ligase）
D. 端	粒	酶（telomerase）

正確答案：D. 端	粒	酶（telomerase）